Clinical trial exclusion criterion:
Plasma donation within one month of screening or any blood donation/blood loss > 500 mL within 3 months prior to screening or during the study.

Entity relations:
- Has_temporal("Plasma donation", "within one month of screening")
- Has_index("within one month of screening", "screening")
- Has_value("blood loss", "> 500 mL")
- Has_temporal("blood donation", "within 3 months prior to screening")
- OR("blood donation", "blood loss")
- OR("within 3 months prior to screening", "during the study")
- OR("Plasma donation", "blood donation")